En la generación de hibridomas por la metodología convencional, la presencia de aminopterina en el medio de selección tiene por objeto inhibir la síntesis de:
1. Purinas.
2. Citosinas.
3. Anticuerpos.
4. Glutamina.

Respuesta correcta: 1. Purinas.